Clinical trial exclusion criterion:
Less than 2-year disease free from another primary malignancy (other than squamous or basal cell carcinoma of the skin, "in-situ" carcinoma of the cervix or breast, superficial bladder carcinoma, or previously treated localized prostate cancer with normal prostate specific antigen (PSA) levels). Patients who have had completed all anti-cancer treatment for another primary malignancy more than 2 years prior to screening are eligible if they are not considered to have a "currently active" malignancy based on having less than a 30% risk of relapse.

Entity relations:
- Has_qualifier("primary malignancy", "another")
- Has_temporal("disease free", "Less than 2-year")
- AND("disease free", "primary malignancy")
- Has_value("prostate specific antigen (PSA) levels", "normal")
- AND("localized prostate cancer", "prostate specific antigen (PSA) levels")
- Has_qualifier("primary malignancy", "another")
- Has_index("more than 2 years prior", "screening")
- AND("anti-cancer treatment", "primary malignancy")
- Has_temporal("anti-cancer treatment", "more than 2 years prior")
- Has_negation("squamous or basal cell carcinoma of the skin", "other than")
- AND("disease free", "squamous or basal cell carcinoma of the skin")
- Has_negation("anti-cancer treatment", "are eligible")
- OR("squamous or basal cell carcinoma of the skin", ""in-situ" carcinoma of the cervix breast", ""in-situ" carcinoma of the cervix", "superficial bladder carcinoma", "localized prostate cancer")